Participation in another clinical trial during the present clinical trial or within the last three months

The above is a clinical trial exclusion criterion. Annotated with entity spans:
[Competing_trial: Participation in another clinical trial during the present clinical trial or within the last three months]